下列腫瘤指數與其適用腫瘤種類的配對，何者錯誤？
A. 攝護腺癌：prostate specific antigen（PSA）
B. 攝護腺癌：lactate dehydrogenase（LDH）
C. 睪丸癌：alpha-fetoprotein（AFP）
D. 睪丸癌：human chorionic gonadotropin（hCG）

正確答案：B. 攝護腺癌：lactate dehydrogenase（LDH）